對中型靜脈的敘述，下列何者錯誤？
A. 其瓣膜為半月狀
B. 瓣膜由平滑肌構成
C. 瓣膜主要由結締組織形成軸心，外覆蓋內皮細胞
D. 腿部的中型靜脈常具瓣膜

正確答案：B. 瓣膜由平滑肌構成